受披衣菌（Chlamydia）感染的宿主細胞中所觀察到的包涵體（inclusion body）構造，其主要成分為：
A. 繁殖後的大量菌體
B. 磷酸鹽（phosphate）聚合物
C. 含殺菌物質的顆粒
D. 大量表現的熱休克（heat shock）蛋白

正確答案：A. 繁殖後的大量菌體